Clinical trial inclusion criterion:
age over 40

Annotated entities:
- Person: "age"
- Value: "over 40"